Clinical trial exclusion criterion:
7. History of any cerebrovascular accident;

Annotated entities:
- Condition: "any cerebrovascular accident"
- Temporal: "History of"